Clinical trial exclusion criterion:
Serious tear film dysfunction syndrome TBUT < 5 s Schirmer: < 4 mm OSDI > 30 pints Corneal staining > grade III on the Oxford scale

Entity relations:
- Has_value("TBUT", "< 5 s")
- Has_value("Schirmer", "< 4 mm")
- Has_qualifier("Corneal staining", "Oxford scale")
- Has_value("Corneal staining", "> grade III")
- Has_value("OSDI", "> 30 pints")